Which algorithms have been developed for analysing CRISPR/Cas9 knockout screens data?

HiTSelect and MAGeCK (Model-based Analysis of Genome-wide CRISPR/Cas9 Knockout)